Leukemia, lymphomas of any type, melanoma, or other malignant neoplasms affecting the bone marrow or lymphatic systems.

The above is a clinical trial exclusion criterion. Annotated with entity spans:
[Condition: Leukemia], [Condition: lymphomas] of any type, [Condition: melanoma], or other [Condition: malignant neoplasms] [Qualifier: affecting the bone marrow] or [Condition: lymphatic systems].